Clinical trial exclusion criterion:
(iii) for subjects enrolled at Indian sites: oral poliomyelitis vaccine (OPV) received during National Immunization Days (NIDs) and supplementary immunization activity days (SIADs)

Entity relations:
- Has_index("during National Immunization Days (NIDs)", "National Immunization Days (NIDs)")
- Has_index("during supplementary immunization activity days (SIADs)", "supplementary immunization activity days (SIADs)")
- Has_temporal("oral poliomyelitis vaccine (OPV)", "during National Immunization Days (NIDs)")
- AND("Indian sites", "oral poliomyelitis vaccine (OPV)")
- Has_temporal("oral poliomyelitis vaccine (OPV)", "during supplementary immunization activity days (SIADs)")